Clinical trial exclusion criterion:
history of allergy to study drugs

Entity relations:
- AND("allergy", "study drugs")